一位 9 歲女童發燒與咳嗽 3 天後，因為右側膝關節腫脹前來就診，身體檢查發現雙側呼吸音有細囉音（fine crackles），心臟檢查正常。下列那一種疾病的可能性最高？
A. Mycoplasma pneumoniae infection
B. Anaphylactoid purpura
C. Enterovirus infection
D. Rheumatic fever

正確答案：A. Mycoplasma pneumoniae infection